Clinical trial inclusion criteria:
Current height less than 5th percentile AND/OR
Predicted adult height (based on bone age) more than 10 cm below target height (mid parental height)
Evidence of puberty: physical signs and serum luteinizing hormone > 0.3 IU/L and testosterone > 15 ng/dl

Annotated entities:
- Temporal: "Current"
- Measurement: "height"
- Value: "less than 5th percentile"
- Non-representable: "AND/OR"
- Measurement: "Predicted adult height"
- Qualifier: "bone age"
- Value: "more than 10 cm below target height"
- Qualifier: "mid parental height"
- Observation: "Evidence of puberty"
- Measurement: "serum luteinizing hormone"
- Condition: "physical signs"
- Value: "> 0.3 IU/L"
- Measurement: "testosterone"
- Value: "> 15 ng/dl"